Clinical trial exclusion criterion:
Preoperative anticoagulation therapy

Annotated entities:
- Temporal: "Preoperative"
- Procedure: "anticoagulation therapy"
- Drug: "anticoagulation"